Acude a la consulta una mujer de 30 años de edad refiriendo en los tres últimos meses ansiedad, pérdida de unos 6 kg de peso y sensación de “nerviosismo”. En la exploración física destaca taquicardia, hiperreflexia y ausencia de bocio. En la analítica realizada los valores de la TSH son < a 0.01 microU/mL, la T4 está elevada y los niveles de tiroglobulina descendidos. Al realizarle una gammagrafía se detecta una ausencia de captación en la región tiroidea. ¿Cuál le parece el diagnóstico más probable?:
1. Tirotoxicosis facticia.
2. Hipertiroidismo por Enfermedad de Graves.
3. Teratoma de ovario (estruma ovárico).
4. Tiroiditis subaguda.

Respuesta correcta: 1. Tirotoxicosis facticia.